Clinical trial inclusion criterion:
Has a diagnosis of major depressive disorder by Diagnostic and Statistical Manual of Mental Disorders, Fourth Edition (DSM-IV) criteria.

Annotated entities:
- Condition: "major depressive disorder"
- Qualifier: "Diagnostic and Statistical Manual of Mental Disorders, Fourth Edition (DSM-IV) criteria"